有關前列腺肥大造成之下泌尿道症狀（lower urinary tract symptoms）之敘述，下列何者錯誤？
A. 病人常主訴半夜起來小便，尿流特別細小緩慢
B. 下泌尿道症狀，通常可以分為阻塞型（obstructive）及刺激型（irritative）症狀兩大類
C. 頻尿及夜尿次數增加，是屬於阻塞型症狀
D. 尿不乾淨，有大量殘尿的病人，比較會頻尿及夜尿；但是頻尿及夜尿的病人，不一定有大量殘尿

正確答案：C. 頻尿及夜尿次數增加，是屬於阻塞型症狀